Breastfed exclusively or predominantly (>50% meals) at inclusion

The above is a clinical trial inclusion criterion. Annotated with entity spans:
[Condition: Breastfed] [Qualifier: exclusively] or [Qualifier: predominantly] ([Multiplier: >50% meals]) [Temporal: at inclusion]